Clinical trial exclusion criterion:
cannot communicate.

Annotated entities:
- Observation: "cannot communicate"